¿Cómo se puede sintetizar un alcohol terciario?:
1. A partir de un aldehído y un organomagnesiano.
2. Por reducción de una cetona con borohidruro sódico.
3. Por reacción de un aldehído con borohidruro sódico.
4. Por reacción de un éster carboxílico con un organomagnesiano.

Respuesta correcta: 4. Por reacción de un éster carboxílico con un organomagnesiano.